左肺門附近的構造中，下列何者的位置最高？
A. 肺動脈
B. 肺靜脈
C. 左支氣管
D. 肺韌帶（pulmonary ligament）

正確答案：A. 肺動脈